有關呼吸鏈之化學滲透理論（chemiosmotic theory），下列敘述何者正確？
A. 氧化磷酸化在粒線體外膜進行
B. 粒線體內膜之內外側質子（protons）的濃度相同
C. ATP synthase 在 chemiosmotic theory 沒有重要性
D. ATP 的合成與質子移動力（proton-motive force）有關

正確答案：D. ATP 的合成與質子移動力（proton-motive force）有關